Clinical trial inclusion criterion:
Symptoms for at least 3 months

Annotated entities:
- Condition: "Symptoms"
- Temporal: "for at least 3 months"